Clinical trial inclusion criterion:
Scheduled for gynecological laparoscopic surgery

Annotated entities:
- Qualifier: "gynecological"
- Procedure: "laparoscopic surgery"
- Mood: "Scheduled"